Current or history of suicidal ideation

The above is a clinical trial exclusion criterion. Annotated with entity spans:
[Temporal: Current] or [Temporal: history] of [Condition: suicidal ideation]